Clinical trial inclusion criterion:
Pathologically proven unresectable adenocarcinoma of stomach

Annotated entities:
- Condition: "adenocarcinoma of stomach"
- Qualifier: "unresectable"
- Measurement: "Pathologically"
- Value: "proven"